Clinical trial inclusion criterion:
Subjects were to give voluntary written informed consent to participate in the trial.

Annotated entities:
- Post-eligibility: "Subjects were to give voluntary written informed consent to participate in the trial"